造成產後出血的原因，下列何者最常見？
A. 子宮收縮不佳（atony）
B. 羊水栓塞（amniotic fluid embolism）
C. 胎盤滯留（retained placenta）
D. 生殖道撕裂傷（injury to birth canal）

正確答案：A. 子宮收縮不佳（atony）